Treatment with any other investigational drug within the last three months before Screening

The above is a clinical trial exclusion criterion. Annotated with entity spans:
[Procedure: Treatment] with any other [Drug: investigational drug] [Temporal: within the last three months before Screening]